Clinical trial exclusion criterion:
A failed therapeutic trial of escitalopram in the current depressive episode (defined as at least 6 weeks of treatment at a daily dose of 10mg or higher)

Annotated entities:
- Drug: "escitalopram"
- Procedure: "therapeutic trial"
- Qualifier: "failed"
- Temporal: "in the current depressive episode"
- Reference_point: "depressive episode"
- Condition: "depressive episode"
- Temporal: "at least 6 weeks of treatment"
- Multiplier: "daily dose of 10mg or higher"